Negative H. pylori test .

The above is a clinical trial inclusion criterion. Annotated with entity spans:
[Value: Negative] [Measurement: H. pylori test] .